Clinical trial exclusion criterion:
Subjects who, during the course of the study, would be likely to require treatment with prohibited concomitant therapy .

Annotated entities:
- Non-query-able: "Subjects who, during the course of the study, would be likely to require treatment with prohibited concomitant therapy"